Clinical trial inclusion criteria:
After half-dose ticagrelor (loading dose 90mg, and then 45mg bidpo.) treatment for 3 days, the platelet aggregation is effectively inhibited by light transmission aggregometry method and thromboela-stogram.
planned to undergo PCI recently
planned to DAPT for 1 year after PCI

Annotated entities:
- Multiplier: "half-dose"
- Drug: "ticagrelor"
- Measurement: "loading dose"
- Value: "90mg"
- Multiplier: "45mg bidpo."
- Temporal: "treatment for 3 days"
- Measurement: "platelet aggregation"
- Value: "inhibited"
- Qualifier: "effectively"
- Procedure: "light transmission aggregometry"
- Procedure: "thromboela-stogram"
- Mood: "planned to undergo"
- Procedure: "PCI"
- Temporal: "recently"
- Mood: "planned to"
- Procedure: "DAPT"
- Multiplier: "for 1 year"
- Temporal: "after PCI"
- Procedure: "PCI"
- Reference_point: "PCI"